Preoperative Heart Rate less than 50 beat/min

The above is a clinical trial exclusion criterion. Annotated with entity spans:
[Measurement: Preoperative Heart Rate] [Value: less than 50 beat/min]